Has had a solid organ or hematologic transplant

The above is a clinical trial exclusion criterion. Annotated with entity spans:
Has had a [Procedure: solid organ] or [Procedure: hematologic transplant]